Toll-like 受器（TLRs）執行訊息傳遞，下列那一種存在於細胞膜上，能接受細菌之 lipopolysaccharide （LPS）刺激？
A. TLR-3
B. TLR-4
C. TLR-5
D. TLR-7

正確答案：B. TLR-4